下列何種途徑投與硝化甘油（nitroglycerin）後無法達到有效之血中濃度？
A. 舌下
B. 口服
C. 靜脈注射
D. 皮膚貼片

正確答案：B. 口服